En un estudio de cohorte la población tratada con un fármaco anticoagulante tuvo una incidencia de hemorragia grave del 3%, mientras que en la población no tratada la incidencia de hemorragia grave fue del 1%, siendo el NNH ("Number Needed to Harm") de 50. ¿Cuál es la interpretación correcta de este dato?
1. En el grupo tratado con el anticoagulante 50 personas presentaron una hemorragia grave.
2. En el grupo tratado con anticoagulante hubo 50 casos de hemorragia grave más que en el grupo no tratado.
3. El riesgo de presentar una hemorragia grave en los tratados con el anticoagulante fue 50 veces mayor que en los no tratados.
4. Fue necesario tratar a 50 personas con el anticoagulante para producir 1 caso de hemorragia grave atribuible al fármaco.
5. De cada 100 pacientes tratados con el anticoagulante    50     presentaron     una hemorragia grave.

Respuesta correcta: 4. Fue necesario tratar a 50 personas con el anticoagulante para producir 1 caso de hemorragia grave atribuible al fármaco.